¿Cómo cultivaría los micoplasmas?:
1. En medios con ácido micólicos, componentes básicos de su pared celular.
2. En el medio Lowenstein Jensen y durante varias semanas, debido a su lento crecimiento.
3. En medios con esteroles, lípidos necesarios para su membrana citoplasmática.
4. En medio Sabouraud, selectivo para hongos.

Respuesta correcta: 3. En medios con esteroles, lípidos necesarios para su membrana citoplasmática.